Significant hepatic impairment (Serum GPT > 120 U/L).

The above is a clinical trial exclusion criterion. Annotated with entity spans:
[Qualifier: Significant] [Condition: hepatic impairment] ([Measurement: Serum GPT] [Value: > 120 U/L]).